Clinical trial exclusion criterion:
Severe uncorrected visual or auditory handicaps

Entity relations:
- Has_qualifier("auditory handicaps", "uncorrected")
- Has_qualifier("auditory handicaps", "Severe")
- OR("auditory handicaps", "handicaps visual")